female infertile patients eligible for IVF treatment

The above is a clinical trial inclusion criterion. Annotated with entity spans:
[Person: female] [Condition: infertile] patients [Mood: eligible] for [Procedure: IVF treatment]